有關脂漏性皮膚炎（seborrheic dermatitis）之敘述，下列何者為非？
A. 秋季加劇
B. 皮疹為紅色帶油性痂皮的斑塊
C. 皮疹分布於眉間、鼻唇溝、前額、眉毛、臉頰、耳後及前胸
D. 由高血脂所引起

正確答案：D. 由高血脂所引起